Clinical trial exclusion criterion:
anticipation of a required drug test in the 4 weeks following the study.

Entity relations:
- Has_temporal("drug test", "in the 4 weeks following the study")
- Has_mood("drug test", "anticipation of")